甲君在激烈運動後立刻飲下一瓶高酒，且未進食，下列有關其體內醣類代謝之敘述何者錯誤？
A. 可能會造成低血糖（hypoglycemia）
B. 酒精代謝會消耗 NAD+
C. 造成肝醣分解（glycogenolysis）減少
D. 造成糖質新生作用（gluconeogenesis）減少

正確答案：C. 造成肝醣分解（glycogenolysis）減少